Clinical trial inclusion criteria:
= 20years of age;
diagnosis of stroke (>6months);
sedentary or insufficiently active;
have a writing medical permission to participate in the training program.

Annotated entities:
- Person: "age"
- Value: "= 20years"
- Condition: "stroke"
- Temporal: ">6months"
- Observation: "sedentary"
- Observation: "insufficiently active"
- Non-query-able: "have a writing medical permission to participate in the training program"